5. Nursing women

The above is a clinical trial exclusion criterion. Annotated with entity spans:
[Parsing_Error: 5.] [Condition: Nursing] [Person: women]